Can you summarize Myasthenia Gravis?

Myasthenia gravis (MG) is a neuromuscular disease resulting from a disorder of the central nervous system. Pathogenesis is still unknown and temporal lobe has been thought to take part in the epileptogenesis. MG can be symptomatic of focal cortical malformation, in which there is intraepithelial (usually intraepidermal) infiltration by neoplastic cells showing glandular differentiation. Clinical symptoms occur first after an age of approximately 30 years. Main manifestations include cognitive decline, parkinsonism, features of spinocerebellar degeneration, and peripheral